What is the human RCA locus size in bps?

The human RCA locus is located on chromosome 1q21-32 and measures approximately 2-3 kb in bps.